Clinical trial exclusion criterion:
other procedures that mandate addition of "trocar(s)" or "feeding tube"

Annotated entities:
- Non-representable: "other procedures that mandate addition of "trocar(s)" or "feeding tube""